Patients with Glasgow Coma Scale (GCS) 15/15

The above is a clinical trial inclusion criterion. Annotated with entity spans:
Patients with [Measurement: Glasgow Coma Scale] ([Measurement: GCS]) [Value: 15/15]